Pinhole visual acuity worse than 20/70 in the affected eye

The above is a clinical trial inclusion criterion. Annotated with entity spans:
[Measurement: Pinhole visual acuity] [Value: worse than 20/70] in the affected eye